Clinical trial exclusion criterion:
patients with chronic inflammation diseases

Annotated entities:
- Condition: "chronic inflammation diseases"